Señale cuál de los siguientes fármacos tiene acción antihipertensiva:
1. Pancuronio.
2. Nitroprusiato sódico.
3. Procainamida.
4. Salbutamol.
5. Claritromicina.

Respuesta correcta: 2. Nitroprusiato sódico.